Clinical trial exclusion criterion:
Severe heart failure or cardiogenic shock

Entity relations:
- Has_qualifier("heart failure", "Severe")
- OR("heart failure", "cardiogenic shock")